Pronounced congenital defects or serious chronic diseases in the acute stage, including any clinically important exacerbation of chronic diseases of the liver, kidney, cardiovascular, nervous system, mental diseases or metabolic disorders, confirmed by the history or objective examination (pulmonary: cystic fibrosis, lung abscess, empyema, active tuberculosis; extra-pulmonary: congestive heart failure, malabsorption, chronic renal and hepatic failure, cirrhosis, malignancy, immunodeficiency, cirrhosis of the liver);

The above is a clinical trial exclusion criterion. Annotated with entity spans:
Pronounced [Condition: congenital defects] or [Qualifier: serious] [Condition: chronic diseases] in the [Qualifier: acute stage], including any [Qualifier: clinically important] [Condition: exacerbation] of [Qualifier: chronic] [Condition: diseases of the liver], kidney, cardiovascular, nervous system, [Condition: mental diseases] or [Condition: metabolic disorders], confirmed by the history or objective examination (pulmonary: [Condition: cystic fibrosis], [Condition: lung abscess], [Condition: empyema], [Qualifier: active] [Condition: tuberculosis]; extra-pulmonary: [Condition: congestive heart failure], [Condition: malabsorption], [Qualifier: chronic] [Condition: renal] and [Condition: hepatic failure], [Condition: cirrhosis], [Condition: malignancy], [Condition: immunodeficiency], [Condition: cirrhosis of the liver]);